Clinical trial exclusion criterion:
Any confirmed or suspected immunosuppressive or immunodeficient condition based on medical history and physical

Entity relations:
- OR("immunosuppressive condition", "immunodeficient condition")